Household or other close/intimate contact(s) under the age of 12 months.

The above is a clinical trial exclusion criterion. Annotated with entity spans:
[Person: Household] or other [Person: close/intimate contact(s)] [Value: under] the [Person: age] of 12 months.